What makes telomerase a good drug target?

Telomerase, a ribonucleoprotein enzyme is considered as a universal therapeutic target of cancer because of its preferential expression in cancer cells and its presence in 90 % of tumors. Human telomerase is absent in most normal tissues, but is abnormally activated in all major cancer cells.